Clinical trial inclusion criterion:
Failure of prior therapy (during or after treatment) in patients who have received at least two prior chemotherapy regimens;

Annotated entities:
- Multiplier: "at least two"
- Procedure: "chemotherapy"
- Qualifier: "Failure"